關於大腸直腸穿刺傷（penetrating colorectal injury）的敘述，下列何者錯誤？
A. 大腸直腸穿刺傷的處理必須考慮受傷的機制、受傷後到外科手術間的時間延遲、病人腹膜腔內所受到感染的程度
B. 直接修復（primary repair）穿刺傷只適用於生命徵象穩定且傷害及感染程度較輕的病人
C. 所有伴隨有腸繫膜內血管損傷的患者都可以進行直接修復（primary repair）
D. 直腸穿刺傷的直接修復（primary repair）比大腸的穿刺傷修復困難，且大部分的直腸穿刺傷都伴隨著相當程度的感染，也因此經常需要人工肛門來輔助治療

正確答案：C. 所有伴隨有腸繫膜內血管損傷的患者都可以進行直接修復（primary repair）